Clinical trial exclusion criterion:
Severe or uncontrolled hypertension [resting Systolic Blood Pressure (SBP) >180 millimeters of mercury (mmHg), or resting Diastolic Blood Pressure (DBP) >110mmHg at screening period].

Annotated entities:
- Condition: "hypertension"
- Qualifier: "uncontrolled"
- Qualifier: "Severe"
- Measurement: "Systolic Blood Pressure"
- Measurement: "SBP"
- Value: ">180 millimeters of mercury"
- Value: ">180 mmHg"
- Measurement: "Diastolic Blood Pressure"
- Measurement: "DBP"
- Value: ">110mmHg"
- Temporal: "at screening period"
- Reference_point: "screening"
- Qualifier: "resting"
- Qualifier: "resting"